Area within each school district that is in need of a well

The above is a clinical trial inclusion criterion. Annotated with entity spans:
Area within each [Visit: school district that is in need of a well]